Clinical trial exclusion criterion:
Metabolic or hormonal abnormalities

Annotated entities:
- Condition: "hormonal abnormalities"
- Condition: "Metabolic abnormalities"